Clinical trial inclusion criterion:
Patient has a prostate size between 90g and 200g, as determined by MRI

Annotated entities:
- Value: "between 90g and 200g"
- Measurement: "prostate size"
- Procedure: "MRI"